Clinical trial exclusion criterion:
Recent participation (within 28 days) in other research studies

Annotated entities:
- Temporal: "within 28 days"
- Context_Error: "Recent participation (within 28 days) in other research studies"
- Post-eligibility: "Recent participation (within 28 days) in other research studies"